Clinical trial inclusion criterion:
> 18 years of age and < 70 years of age

Entity relations:
- Has_value("age", "> 18 years and < 70 years")